Clinical trial inclusion criterion:
CHB patients who had received NAs for more than 12 months.

Annotated entities:
- Condition: "CHB"
- Drug: "NAs"
- Temporal: "more than 12 months."